Which programming language has been used for implementing GWAR?

Stata